The treatment group will receive 5 consecutive daily hyperbaric treatments, 1 hours long each, at 2 ATF, starting from day 7 to peel. Prior to treatment, each patient will be signed on informed consent and will have complete physical examination.

The above is a clinical trial inclusion criterion. Annotated with entity spans:
[Non-representable: The treatment group will receive 5 consecutive daily hyperbaric treatments, 1 hours long each, at 2 ATF, starting from day 7 to peel.] Prior to treatment, each patient will be signed on informed consent and will have complete physical examination.